Sensitization (i.e. PRA >20%)

The above is a clinical trial exclusion criterion. Annotated with entity spans:
[Condition: Sensitization] (i.e. [Measurement: PRA] [Value: >20%])